Clinical trial exclusion criterion:
Systolic BP more than 160mmHg

Entity relations:
- Has_value("Systolic BP", "more than 160mmHg")